引發第一型過敏免疫反應的呼吸道疾病時，下列那一項有關過敏原特性的描述最恰當？
A. 常具有酵素活性
B. 常是大分子的蛋白質
C. 此類分子通常水溶性差
D. 此類分子通常不太穩定

正確答案：A. 常具有酵素活性